精索積水（hydrocele of the spermatic cord）是由於下列何者閉鎖不全造成？
A. 白膜（tunica albuginea）
B. 鞘突（processus vaginalis）
C. 泌尿生殖竇（urogenital sinus）
D. 泌尿生殖褶（urogenital fold）

正確答案：B. 鞘突（processus vaginalis）